Clinical trial inclusion criterion:
7. Patients with idiopathic sensory neuropathy must have had pain of at least 3 months' duration

Entity relations:
- Has_temporal("pain", "at least 3 months' duration")
- AND("idiopathic sensory neuropathy", "pain")